Clinical trial inclusion criterion:
Radical (total) cystectomy

Entity relations:
- Subsumes("Radical cystectomy", "total cystectomy")